Available at school for at least the first pharyngeal swab and willing to comply with study procedures

The above is a clinical trial inclusion criterion. Annotated with entity spans:
Available at school for at least the [Multiplier: first] [Procedure: pharyngeal swab] and [Mood: willing to] [Observation: comply with study procedures]